Clinical trial inclusion criteria:
Male or Female.
No age restriction.
Diagnosed with an infection related stone.
Medically fit for definitive surgical management of stone.
Life expectancy greater than one year.
Stone free after definitive surgical therapy defined as fragments less than 3mm.

Annotated entities:
- Person: "Male"
- Person: "Female"
- Qualifier: "infection related"
- Condition: "stone"
- Mood: "Medically fit for"
- Procedure: "definitive surgical management"
- Condition: "stone"
- Observation: "Life expectancy"
- Value: "greater than one year"
- Condition: "Stone"
- Negation: "free"
- Temporal: "after definitive surgical therapy"
- Reference_point: "definitive surgical therapy"
- Procedure: "definitive surgical therapy"
- Qualifier: "fragments less than 3mm"